一位兒童因腹瀉求診，他排的糞便為稀水便，糞便檢	並無白血球（leukocytes），臨床上呈現因禁食而改善症狀，下列那一種檢查結果最為吻合？
A. 糞便檢查中無還原物質（reducing substances）
B. 吐氣中氫氣濃度降低（decreased breath hydrogen）
C. 困難梭狀桿菌（Clostridium difficile）毒素檢測為陽性
D. 糞便離子間距 （ion gap） 大於 200 mOsm/kg

正確答案：D. 糞便離子間距 （ion gap） 大於 200 mOsm/kg